Clinical trial exclusion criterion:
HIV (+)

Annotated entities:
- Condition: "HIV (+)"